Clinical trial exclusion criterion:
Patients with a previous use of IFN anti hepatitis B virus treatment or have NAs drug resistance.

Annotated entities:
- Drug: "IFN"
- Qualifier: "anti hepatitis B virus"
- Condition: "resistance"
- Drug: "NAs drug"